Clinical trial exclusion criterion:
Autoimmune disease

Annotated entities:
- Condition: "Autoimmune disease"